¿Qué representa la onda T en el electrocardiograma?:
1. Despolarización auricular.
2. Repolarización auricular.
3. Despolarización ventricular.
4. Repolarización ventricular.

Respuesta correcta: 4. Repolarización ventricular.